Sick sinus syndrome.

The above is a clinical trial exclusion criterion. Annotated with entity spans:
[Condition: Sick sinus syndrome].